¿Cuál de los siguientes fármacos sería el más indicado inicialmente en un paciente con un trastorno obsesivo-compulsivo?
1. Buspirona.
2. Risperidona.
3. Alprazolam.
4. Clomipramina.
5. Metilfenidato.

Respuesta correcta: 4. Clomipramina.